Renal of hepatic insufficiency

The above is a clinical trial exclusion criterion. Annotated with entity spans:
[Condition: Renal] of [Condition: hepatic insufficiency]